No previous treatment with hematopoietic growth factors within 3 months prior to screening

The above is a clinical trial inclusion criterion. Annotated with entity spans:
No previous treatment with [Drug: hematopoietic growth factors] [Temporal: within 3 months prior to screening]